Which kinase is inhibited by Tripolin A?

Tripolin A inhibits Aurora A kinase activity both in vitro and in human cells.